La técnica que estimula la corteza cerebral aplicando pulsos eléctricos mediante una bobina electromagnética, que se utiliza para el tratamiento de algunos trastornos como la depresión, se denomina:
1. Estimulación magnética transcraneal.
2. Fotoestimulación intracerebral.
3. Resonancia magnética funcional o RMf.
4. Potenciales evocados de estimulación.
5. Magnetoencefalografía.

Respuesta correcta: 1. Estimulación magnética transcraneal.